En el periodo preoperatorio (2-6 años) el niño suele pensar que las cosas de la naturaleza (ríos, montañas, etc.) han sido construidas por el ser humano. Esta característica se denomina:
1. Animismo.
2. Realismo.
3. Artificialismo.
4. Utilitarismo.
5. Error preoperatorio.

Respuesta correcta: 3. Artificialismo.